Clinical trial inclusion criterion:
Life expectancy of >12 weeks.

Annotated entities:
- Observation: "Life expectancy"
- Value: ">12 weeks"